Clinical trial inclusion criterion:
Systolic heart failure with New York Heart Association (NYHA) class II-III.

Entity relations:
- Has_value("New York Heart Association (NYHA)", "class II-III")
- AND("Systolic heart failure", "New York Heart Association (NYHA)")